Clinical trial inclusion criterion:
Patients meet criteria for low to moderate risk for moderate exercise based oon the ACSM guidelines.

Annotated entities:
- Value: "low"
- Value: "moderate"
- Measurement: "risk for moderate exercise"
- Measurement: "ACSM guidelines"